Clinical trial exclusion criterion:
Use of a non-prescription drug and herbal substances during the study (through the Final Study Visit). The last dose of any non-prescription drug must have been taken greater than 5 half-lives for that drug before receiving study drug.

Entity relations:
- Has_temporal("non-prescription drug", "during the study")
- Has_temporal("herbal substances", "during the study")
- Has_temporal("any non-prescription drug", "greater than 5 half-lives before receiving study drug")
- OR("non-prescription drug", "herbal substances")